下列何種症狀屬於精神分裂症正性症狀（positive symptoms）？
A. 思維貧乏
B. 注意力不集中
C. 幻覺
D. 情感淡漠

正確答案：C. 幻覺